Clinical trial exclusion criterion:
Severe erosive esophagitis, severe esophageal stricture, active gastric or duodenal ulcer

Entity relations:
- Has_qualifier("erosive esophagitis", "Severe")
- Has_qualifier("esophageal stricture", "severe")
- Has_qualifier("gastric ulcer", "active")
- OR("gastric ulcer", "duodenal ulcer")
- OR("erosive esophagitis", "esophageal stricture", "gastric ulcer")